1. History or presence of allergy to the study drugs or their components or drugs of their class, or a history of drug or other allergy that, in the opinion of the physician responsible, contraindicates their participation

The above is a clinical trial exclusion criterion. Annotated with entity spans:
[Parsing_Error: 1.] [Subjective_judgement: History or presence of allergy to the study drugs or their components or drugs of their class, or a history of drug or other allergy that, in the opinion of the physician responsible, contraindicates their participation]